Clinical trial exclusion criterion:
Asthma;

Annotated entities:
- Condition: "Asthma"